Clinical trial exclusion criterion:
Presence of hepatic comorbidities

Annotated entities:
- Condition: "hepatic comorbidities"